Clinical trial exclusion criterion:
Patient has participated in a Novartis sponsored combination trial where nilotinib was dispensed in combination with another study medication and patient is still receiving combination therapy

Annotated entities:
- Qualifier: "Novartis sponsored"
- Observation: "participated in a combination trial"
- Non-representable: "Patient has participated in a Novartis sponsored combination trial where nilotinib was dispensed in combination with another study medication and patient is still receiving combination therapy"